下列何種胰臟良性腫瘤特別好發於年輕女性？
A. Serous cystadenoma
B. Mucinous cystadenoma
C. Intraductal papillary mucinous tumor（IPMT）
D. Solid-pseudopapillary tumor of the pancreas

正確答案：D. Solid-pseudopapillary tumor of the pancreas